關於脈搏壓（pulse pressure）的敘述，下列何者正確？
A. 收縮壓（systolic pressure）增加時，脈搏壓一定會增加
B. 脈搏壓的大小與動脈的順應性（compliance）無關
C. 脈搏壓可能因心搏量（stroke volume）增加而上升
D. 脈搏壓可能因舒張壓（diastolic pressure）的上升而上升

正確答案：C. 脈搏壓可能因心搏量（stroke volume）增加而上升